有關穩定性（stable）與脆弱性（vulnerable）動脈硬化斑（atherosclerotic plaque）之比較，下列敘述何者錯誤？
A. 穩定性斑塊的脂質核心較大
B. 穩定性斑塊較少發炎細胞浸潤
C. 脆弱性斑塊含大量泡沫狀細胞
D. 脆弱性斑塊的纖維帽較薄

正確答案：A. 穩定性斑塊的脂質核心較大